Describe mechanism of action of PLX3397 drug.

PLX3397 works by inhibiting colony-stimulating-factor-1 receptor (CSF1R).